3. Have been taking corticosteroids for longer than 48 hours.

The above is a clinical trial exclusion criterion. Annotated with entity spans:
3. Have been taking [Drug: corticosteroids] for [Temporal: longer than 48 hours].